Severe gravidic disease present at inclusion involving life threatening to the mother and/or the child

The above is a clinical trial exclusion criterion. Annotated with entity spans:
[Qualifier: Severe] [Condition: gravidic disease] present at inclusion involving [Qualifier: life threatening] to the mother and/or the child